Clinical trial exclusion criterion:
Do not sign informed consent

Annotated entities:
- Observation: "Do not sign informed consent"